Clinical trial inclusion criterion:
aged 3-9 years

Annotated entities:
- Person: "aged"
- Value: "3-9 years"